Reports drinking a minimum of 5 standard drinks for men or 4 standard drinks for women on at least 4 days per week on average over the past 28 days

The above is a clinical trial inclusion criterion. Annotated with entity spans:
Reports [Measurement: drinking] a [Value: minimum of 5 standard drinks] for [Person: men] or [Value: 4 standard drinks] for [Person: women] on at least 4 days per week on average [Temporal: over the past 28 days]